Known or suspected hypersensitivity to either propofol, e.g. egg or soy allergy, or volatile general anesthetic agents

The above is a clinical trial exclusion criterion. Annotated with entity spans:
[Mood: Known] or [Mood: suspected] [Condition: hypersensitivity] to either [Drug: propofol], e.g. [Drug: egg] or [Drug: soy] [Condition: allergy], or [Drug: volatile general anesthetic agents]